手腕屈曲無力並伴隨著手腕內收動作（adduction）的產生為下列何者受傷的徵兆之一？
A. 正中神經（median nerve）
B. 肌皮神經（musculocutaneous nerve）
C. 橈神經（radial nerve）
D. 尺神經（ulnar nerve）

正確答案：A. 正中神經（median nerve）